下列頸部肌肉與其支配神經之敘述，何者錯誤？
A. 與第十二顱神經伴行之第一頸神經腹側枝（ventral ramus）支配頦舌骨肌（geniohyoid muscle）
B. 二腹肌（Digastric muscle）之前腹（anterior belly）受面神經之頸枝支配
C. 下頜舌骨肌（Mylohyoid muscle）受三叉神經（trigeminal nerve）支配
D. 肩胛舌骨肌（Omohyoid muscle）受頸襻（ansa cervicalis）支配

正確答案：B. 二腹肌（Digastric muscle）之前腹（anterior belly）受面神經之頸枝支配